Absolute neutrophil count less than 750 cells/mm3 even if receiving G-CSF.

The above is a clinical trial exclusion criterion. Annotated with entity spans:
[Measurement: Absolute neutrophil count] [Value: less than 750 cells/mm3] [Qualifier: even if receiving G-CSF].